-Female subjects should refrain from breastfeeding throughout this period.

The above is a clinical trial exclusion criterion. Annotated with entity spans:
-[Person: Female] subjects should [Negation: refrain from] [Observation: breastfeeding] [Temporal: throughout this period.]